¿Cuál de las siguientes afirmaciones es verdadera en relación con la infección por el virus del papiloma humano?
1. Sólo el 20% de las mujeres sexualmente activas se infectará por este virus.
2. La mayoría de las mujeres infectadas desarrollarán displasia cervical o cáncer.
3. No se ha demostrado que otros cofactores como el tabaco o una respuesta inmunitaria alterada estén relacionados con el desarrollo de displasia.
4. El virus es transitorio en la mayoría de las mujeres.

Respuesta correcta: 4. El virus es transitorio en la mayoría de las mujeres.